Clinical trial exclusion criterion:
Hospital acquired infection

Annotated entities:
- Condition: "Hospital acquired infection"